Clinical trial inclusion criterion:
informed consent

Annotated entities:
- Informed_consent: "nformed consent"